Clinical trial exclusion criteria:
Exposure/treatment to an investigational (new chemical entity) or marketed drug or biologic within 30 days preceding the first dose administration, or five half-lives of that investigational drug or biologic, if known (whichever is longer).
Donation blood or serum within 8 weeks before the first dose administration to a blood bank or blood donation center.
History of alcohol or drug abuse (as defined by the current version of the DSM) within 2 years before the first dose administration, or positive alcohol or drug screen.
Vaccination within 30 days prior to the first dose administration or has plans to receive a vaccination during the course of the study (including the follow phone call on Day 105).

Annotated entities:
- Context_Error: "Exposure/treatment to an investigational (new chemical entity) or marketed drug or biologic within 30 days preceding the first dose administration, or five half-lives of that investigational drug or biologic, if known (whichever is longer)."
- Non-query-able: "Exposure/treatment to an investigational (new chemical entity) or marketed drug or biologic within 30 days preceding the first dose administration, or five half-lives of that investigational drug or biologic, if known (whichever is longer)."
- Procedure: "Donation blood"
- Grammar_Error: "Donation blood"
- Procedure: "Donation serum"
- Grammar_Error: "Donation serum"
- Temporal: "within 8 weeks before"
- Reference_point: "first dose administration"
- Condition: "alcohol abuse"
- Condition: "drug abuse"
- Temporal: "History"
- Procedure: "current version of the DSM"
- Temporal: "within 2 years before"
- Reference_point: "the first dose administration"
- Measurement: "alcohol screen"
- Measurement: "drug screen"
- Value: "positive"
- Procedure: "Vaccination"
- Temporal: "within 30 days prior"
- Reference_point: "the first dose administration"
- Mood: "plans"
- Non-query-able: "plans"
- Procedure: "vaccination"
- Temporal: "during the course"
- Reference_point: "study"